Upper gastrointestinal surgery history

The above is a clinical trial exclusion criterion. Annotated with entity spans:
[Procedure: Upper gastrointestinal surgery] [Temporal: history]